El modelo del Sol Naciente pertenece a qué autora:
1. Rosemarie Rizzo Parse.
2. Imogene King.
3. Madeleine Leininger.
4. Hildegarde Peplau.

Respuesta correcta: 3. Madeleine Leininger.